一位 65 歲女性腹脹有三個月之久，經婦產科醫師觸診發現腹腔有腹水現象，內診則在右側卵巢有一顆約 8 公分的固定不易移動及表面有結節的腫瘤，而左側卵巢萎縮不易觸摸到，接受一系列檢查，如尿液、子宮頸抹片、乳房攝影、胸部 X 光、糞便及上腸胃道檢查皆正常，但是腫瘤指數 CA-125 為 950 U/mL，上述病患最有可能是下列那一個診斷？
A. Gonadoblastoma
B. Meigs' syndrome
C. Krukenberg tumor
D. Serous cystadenocarcinoma

正確答案：D. Serous cystadenocarcinoma